Clinical trial exclusion criterion:
Urinary albumin/creatinine ratio higher than 3000 mg/g, at the baseline visit.

Entity relations:
- Has_value("Urinary albumin/creatinine ratio", "higher than 3000 mg/g")
- Has_temporal("Urinary albumin/creatinine ratio", "at the baseline visit")